Clinical trial inclusion criterion:
primigravida, singleton pregnancy, maternal age 18-35 years, and pregnancy duration 16-20 weeks at the time of study inclusion.

Entity relations:
- Has_value("maternal age", "18-35 years")
- Has_value("pregnancy duration", "16-20 weeks")
- Has_temporal("pregnancy duration", "at the time of study inclusion")